Clinical trial inclusion criterion:
6. Has a negative pregnancy test at the Screening visit. An exception for the pregnancy test requirement will be granted for subjects reporting surgical sterilization in medical history

Entity relations:
- Has_index("at the Screening visit", "Screening visit")
- Has_temporal("pregnancy test", "at the Screening visit")
- Has_value("pregnancy test", "negative")